懷孕婦女常見的生理變化，下列敘述何者錯誤？
A. 血比容（Hct, hematocrit）會下降
B. PaCO2會下降
C. 血液中白血球會減少
D. 平均心跳會漸漸增加

正確答案：C. 血液中白血球會減少